Clinical trial inclusion criterion:
Prepared to sign an informed consent

Annotated entities:
- Post-eligibility: "Prepared to sign an informed consent"